Clinical trial exclusion criterion:
Uncontrolled medical problems including pulmonary, cardiovascular or orthopedic disease

Entity relations:
- Subsumes("medical problems", "pulmonary disease")
- Has_qualifier("medical problems", "Uncontrolled")
- OR("pulmonary disease", "cardiovascular disease", "orthopedic disease")